3. ECOG Performance status ≤ 1

The above is a clinical trial inclusion criterion. Annotated with entity spans:
[Parsing_Error: 3.] [Measurement: ECOG Performance status] [Value: ≤ 1]